Clinical trial inclusion criterion:
Minimum of 2 mm of keratinized gingiva

Annotated entities:
- Value: "Minimum of 2 mm"
- Measurement: "keratinized gingiva"